Clinical trial exclusion criteria:
endometrial thickness < 7 mm or no triple layer endometrium and/or functional follicles
Uterine abnormality
Chronic medical disease
oocyte donation cycles

Annotated entities:
- Measurement: "endometrial thickness"
- Value: "< 7 mm"
- Negation: "no"
- Observation: "triple layer endometrium"
- Observation: "functional follicles"
- Condition: "Uterine abnormality"
- Condition: "Chronic medical disease"
- Procedure: "oocyte donation cycles"